Glomerular filtration rate <30mL/minute or on dialysis

The above is a clinical trial exclusion criterion. Annotated with entity spans:
[Measurement: Glomerular filtration rate] [Value: <30mL/minute] or on [Procedure: dialysis]